El lugar donde confluye 2 o 3 cálices mayores del riñón se denomina:
1. Papila renal.
2. Hilio renal.
3. Pelvis renal.
4. Pirámide renal.

Respuesta correcta: 3. Pelvis renal.